BCLC stage of 0-B;

The above is a clinical trial inclusion criterion. Annotated with entity spans:
[Measurement: BCLC stage] of [Value: 0-B];